兒童的腹股溝疝氣（inguinal hernia）理想手術年齡為：
A. 六個月內
B. 六個月至一歲之間
C. 一歲以後
D. 任何年齡

正確答案：D. 任何年齡